Clinical trial exclusion criterion:
Elevated liver enzymes;

Annotated entities:
- Condition: "Elevated liver enzymes"